Subject who is illiterate or unable to understand the Informed Consent Form, questionnaires or subject diary

The above is a clinical trial exclusion criterion. Annotated with entity spans:
Subject who is [Observation: illiterate] or [Negation: unable to] [Informed_consent: understand the Informed Consent Form], questionnaires or subject diary